Bochdalek's hernia 發生的位置為：
A. 腹股溝
B. 肚臍
C. 橫膈膜
D. 顱內

正確答案：C. 橫膈膜